Clinical trial inclusion criterion:
6. Ability to follow verbal or visual commands

Annotated entities:
- Parsing_Error: "6."
- Condition: "Ability to follow verbal commands"
- Condition: "Ability to follow visual commands"